Clinical trial inclusion criterion:
Transient relief of symptoms after diagnostic intra-articular injection into the glenohumeral joint

Annotated entities:
- Procedure: "intra-articular injection"
- Qualifier: "glenohumeral joint"
- Condition: "relief of symptoms"
- Qualifier: "Transient"